¿Cuál de los siguientes fenómenos ocurre en un individuo normal tras la ingesta de carbohidratos?
1. Los niveles de insulina y glucagón disminuyen.
2. Los niveles de insulina y glucagón aumentan.
3. Sólo disminuye el nivel de insulina.
4. Sólo aumenta el nivel de insulina.

Respuesta correcta: 4. Sólo aumenta el nivel de insulina.